Clinical trial exclusion criterion:
current psychosis

Entity relations:
- Has_temporal("psychosis", "current")